Clinical trial exclusion criterion:
A cardiovascular event in the past month

Annotated entities:
- Condition: "cardiovascular event"
- Temporal: "in the past month"